Clinical trial exclusion criterion:
uncontrolled diabetes mellitus type 2 with fasting glucose > 13.3 mmol/l confirmed on a second day

Annotated entities:
- Condition: "diabetes mellitus type 2"
- Qualifier: "uncontrolled"
- Measurement: "fasting glucose"
- Value: "> 13.3 mmol/l"